American society of anesthesiologist (ASA) physical status I or II

The above is a clinical trial inclusion criterion. Annotated with entity spans:
[Measurement: American society of anesthesiologist] ([Measurement: ASA]) physical status [Value: I or II]